Clinical trial exclusion criterion:
Patients with cardiac failure or a history of cardiac failure (New York Heart Association [NYHA] Stages 3 to 4)

Entity relations:
- Subsumes("New York Heart Association Stages", "NYHA")
- Has_value("New York Heart Association Stages", "3 to 4")
- AND("cardiac failure", "New York Heart Association Stages")
- OR("cardiac failure", "history of cardiac failure")